Cuando un enzima cataliza una reacción:
1. No se modifica y puede reutilizarse.
2. No se modifica, pero pierde su actividad.
3. Siempre requiere la participación de cofactores.
4. Se desnaturaliza para facilitar la unión con el sustrato.
5. Siempre requiere energía.

Respuesta correcta: 1. No se modifica y puede reutilizarse.